有關四肢區間症候群（compartment syndrome），下列何者為非？
A. 常發生在肢體外傷，造成缺血狀態之後
B. 必須緊急施作區間鬆解術（compartment release）
C. 若處理不當，會造成截肢或 Volkmann's ischemic contracture 之後果
D. 若區間內壓力超過 10 cmH2O，即須作區間鬆解術

正確答案：D. 若區間內壓力超過 10 cmH2O，即須作區間鬆解術